Clinical trial exclusion criterion:
Medication No use within the following time intervals prior to Screening or thereafter at any time during the study (unless otherwise specified) Inhaled Long acting beta-agonists (LABA) 48 hours ICS/LABA combination products 48 hours Inhaled corticosteroids 48 hours Tiotropium 1 week Systemic, Oral, parenteral, intra-articular corticosteroids 30 days (oral and systemic corticosteroids may be used to treat COPD exacerbations during the study) Cytochrome P450 3A4 strong inhibitors including but not limited to antiretrovirals (protease inhibitors) (e.g.Indinavir, Nelfinavir, Ritonavir, Saquinavir); Imidazole and Triazole anti-fungals (e.g. Ketaconazole, Itraconazole); Clarithromycin, Telithromycin, Amiodarone, and Nefazodone 6 weeks Grapefruit is allowed up to Visit 1, then limited to no more than one glass of grapefruit juice (250 mL/ 8 ounces) or one grapefruit per day Any other investigational drug 30 days or 5 half lives whichever is longer.

Entity relations:
- Has_temporal("Inhaled Long acting beta-agonists (LABA)", "48 hours")
- Has_temporal("ICS/LABA combination products", "48 hours")
- Has_temporal("Inhaled corticosteroids", "48 hours")
- Has_qualifier("corticosteroids", "Systemic")
- Has_temporal("corticosteroids", "30 days")
- Has_qualifier("corticosteroids", "oral")
- AND("treat COPD exacerbations", "COPD exacerbations")
- Has_index("during the study", "the study")
- Has_temporal("treat COPD exacerbations", "during the study")
- Has_temporal("investigational drug", "30 days")
- Subsumes("protease inhibitors", "Indinavir")
- Subsumes("antiretrovirals", "protease inhibitors")
- Subsumes("Imidazole anti-fungals", "Ketaconazole")
- Subsumes("Cytochrome P450 3A4 strong inhibitors", "antiretrovirals")
- Has_temporal("Cytochrome P450 3A4 strong inhibitors", "6 weeks")
- AND("Imidazole anti-fungals", "Triazole anti-fungals")
- OR("Systemic", "Oral", "parenteral", "intra-articular")
- OR("oral", "systemic")
- OR("30 days", "5 half lives")
- OR("antiretrovirals", "Telithromycin", "Amiodarone", "Nefazodone", "Imidazole anti-fungals", "Clarithromycin")
- OR("Indinavir", "Ritonavir", "Nelfinavir", "Saquinavir")
- OR("Ketaconazole", "Itraconazole")
- OR("Screening", "any time during the study")
- OR("Inhaled Long acting beta-agonists (LABA)", "ICS/LABA combination products", "Inhaled corticosteroids", "Tiotropium", "corticosteroids", "corticosteroids", "Cytochrome P450 3A4 strong inhibitors")